目前我國心理衛生工作主要的法源依據為何？
A. 心理衛生法
B. 公共心理衛生法
C. 精神衛生法
D. 社區精神醫療保健法

正確答案：C. 精神衛生法